Un paciente con un infarto de miocardio lateral, presentará una obstrucción a nivel de la arteria:
1. Coronaria derecha.
2. Descendente anterior.
3. Descendente posterior.
4. Diafragmática.
5. Circunfleja.

Respuesta correcta: 5. Circunfleja.